要評估腎臟血管硬化程度，下列那一種方法比較不影響腎功能？
A. 電腦斷層（CT scan）加顯影劑（contrast medium）
B. 標準型血管攝影（standard angiography）
C. 靜脈輸注泌尿道攝影（intravenous urography）
D. 核磁共振血管攝影（magnetic resonance angiography）

正確答案：D. 核磁共振血管攝影（magnetic resonance angiography）